Clinical trial inclusion criteria:
18-50 ages
Singleton pregnancy
Cervical length <=25mm between 18(0) and 23(6) weeks

Annotated entities:
- Person: "ages"
- Value: "18-50"
- Condition: "Singleton pregnancy"
- Measurement: "Cervical length"
- Value: "<=25mm"
- Qualifier: "between 18(0) and 23(6) weeks"